Clinical trial exclusion criterion:
Poor ovarian response (POR) according to the European Society of Human Reproduction and Embryology (ESHRE) Criteria

Annotated entities:
- Condition: "Poor ovarian response (POR)"
- Qualifier: "European Society of Human Reproduction and Embryology (ESHRE) Criteria"